Other intervention for reduction of IAP planned

The above is a clinical trial exclusion criterion. Annotated with entity spans:
[Qualifier: Other] [Procedure: intervention for reduction of IAP] [Mood: planned]